English speaking

The above is a clinical trial inclusion criterion. Annotated with entity spans:
[Non-query-able: English speaking]